「耶和華見證人」（Jehovah's Witnesses）教派信徒在醫療上堅持不接受輸血。近來基於尊重病人自主的倫理原則，法律與倫理逐漸接受耶和華見證人拒絕輸血的意願，應該予以尊重；下列那一種情形，醫師應該尊重一個表明為耶和華見證人的信徒拒絕輸血的意願？
A. 成年且有行為能力的病人情況緊急，如果不輸血的話，病人就會死亡；但有清楚的文書證據，證明病人的
B. 病人是懷孕36週的婦女拒絕輸血
C. 病人是15歲的未成年人拒絕輸血
D. 父母都是耶和華見證人信徒，為其8歲病童拒絕輸血

正確答案：A. 成年且有行為能力的病人情況緊急，如果不輸血的話，病人就會死亡；但有清楚的文書證據，證明病人的